腕隧道症候群（carpal tunnel syndrome）的 test 中，下列何者最準確？
A. Phalen test
B. Tinel's sign
C. Tourniquet test
D. 兩點分辨力（Two-point discrimination）

正確答案：A. Phalen test